Clinical trial inclusion criterion:
Patients with Glasgow Coma Scale (GCS) 15/15

Annotated entities:
- Measurement: "Glasgow Coma Scale"
- Measurement: "GCS"
- Value: "15/15"